Clinical trial exclusion criterion:
History of prior treatment with disulfiram

Annotated entities:
- Drug: "disulfiram"
- Temporal: "History of prior treatment"